Clinical trial inclusion criterion:
Men and women older than 18 years, scheduled consecutively to perform a coronary procedure in the department of hemodynamics of the National Institute of Cardiology "Ignacio Chavez".

Entity relations:
- Has_value("years", "older than 18")
- Has_mood("coronary procedure", "scheduled")
- AND("coronary procedure", "department of hemodynamics")
- AND("department of hemodynamics", "the National Institute of Cardiology "Ignacio Chavez"")
- OR("Men", "women")